下列何者不是催生的藥物？
A. Prostaglandin E2
B. Oxytocin
C. Misoprostol
D. Ritodrine

正確答案：D. Ritodrine